非過敏性鼻炎的治療，以下那一項效果最差？
A. 類固醇鼻噴劑
B. 口服第一代抗組織胺
C. 口服第二代抗組織胺
D. 抗組織胺鼻噴劑

正確答案：C. 口服第二代抗組織胺